Clinical trial inclusion criterion:
18-65 years old

Annotated entities:
- Person: "years old"
- Value: "18-65"